Clinical trial inclusion criterion:
1. Age ≥ 18 years

Entity relations:
- Has_value("Age", "≥ 18 years")